Clinical trial exclusion criterion:
Prior chemotherapy, radiotherapy, or surgery for NSCLC

Annotated entities:
- Drug: "chemotherapy"
- Procedure: "radiotherapy"
- Procedure: "surgery"
- Condition: "NSCLC"
- Temporal: "Prior"